Clinical trial inclusion criterion:
Willing and able to provide written informed consent

Annotated entities:
- Informed_consent: "Willing and able to provide written informed consent"